Clinical trial inclusion criterion:
6. Ability to read and write English -

Annotated entities:
- Post-eligibility: "Ability to read and write English -"
- Non-query-able: "Ability to read and write English -"